Clinical trial inclusion criteria:
1. Age 18 years or older
2. Diagnosis of venous leg ulcer(s), as clinically determined by the investigator by a positive venous reflux test (venous refilling <20 seconds) using Doppler ultrasound for at least 4 weeks prior to screening day, which have not adequately responded to conventional ulcer therapy.
3. Designated venous leg ulcer meets the following criteria at both the screening and baseline visits. If the patient has multiple ulcers, at least one ulcer must meet the following criteria at both the screening and baseline visits:
1. Present for at least 4 weeks
2. CEAP Classification Stage 6
3. Surface ulcer with an area > 15cm2 post debridement
4. Viable, granulating wound (investigator discretion)
4. Ulcers that extend through the epidermis but not through the muscle, tendon, or bone (Stage II or III ulcers as defined by the IAET).
5. Female patients of childbearing potential must have a negative pregnancy test at screening and must agree to use hormonal contraceptive, intrauterine device, diaphragm with spermicide, condom with spermicide, or abstinence throughout until 2 weeks after the last administration of study drug
6. Signed informed consent

Annotated entities:
- Parsing_Error: "1."
- Value: "18 years or older"
- Person: "Age"
- Parsing_Error: "2."
- Condition: "venous leg ulcer(s)"
- Measurement: "venous reflux test"
- Value: "positive"
- Measurement: "venous refilling"
- Value: "<20 seconds"
- Procedure: "Doppler ultrasound"
- Temporal: "at least 4 weeks prior to screening day"
- Reference_point: "screening day"
- Observation: "responded"
- Negation: "not"
- Qualifier: "adequately"
- Procedure: "conventional ulcer therapy"
- Parsing_Error: "3."
- Condition: "venous leg ulcer"
- Parsing_Error: "Designated venous leg ulcer meets the following criteria at both the screening and baseline visits."
- Condition: "ulcers"
- Multiplier: "multiple"
- Multiplier: "at least one"
- Condition: "ulcer"
- Parsing_Error: "If the patient has multiple ulcers, at least one ulcer must meet the following criteria at both the screening and baseline visits:"
- Parsing_Error: "1."
- Temporal: "at least 4 weeks"
- Qualifier: "Present"
- Parsing_Error: "2."
- Measurement: "CEAP Classification"
- Value: "Stage 6"
- Parsing_Error: "3."
- Condition: "Surface ulcer"
- Value: "> 15cm2"
- Measurement: "area post debridement"
- Parsing_Error: "4."
- Qualifier: "Viable"
- Qualifier: "granulating"
- Condition: "wound"
- Subjective_judgement: "investigator discretion"
- Parsing_Error: "4."
- Condition: "Ulcers"
- Qualifier: "extend through the epidermis"
- Qualifier: "extend through the muscle"
- Negation: "not"
- Value: "Stage II or III"
- Measurement: "IAET"
- Condition: "ulcers"
- Qualifier: "extend through the tendon"
- Qualifier: "extend through the bone"
- Parsing_Error: "5."
- Condition: "childbearing potential"
- Measurement: "pregnancy test"
- Value: "negative"
- Temporal: "at screening"
- Reference_point: "screening"
- Drug: "hormonal contraceptive"
- Device: "intrauterine device"
- Device: "diaphragm with spermicide"
- Device: "condom with spermicide"
- Observation: "abstinence"
- Temporal: "throughout until 2 weeks after the last administration of study drug"
- Reference_point: "last administration of study drug"
- Person: "Female"
- Parsing_Error: "6."
- Post-eligibility: "Signed informed consent"
- Non-query-able: "Signed informed consent"